Decline physical function (walking speed < 1 m/s) Group 3 (Either or both)

The above is a clinical trial inclusion criterion. Annotated with entity spans:
[Condition: Decline physical function] ([Measurement: walking speed] [Value: < 1 m/s]) [Non-representable: Group 3 (Either or both)]